Clinical trial exclusion criterion:
infectious, suppurative and allergic dermatosis

Annotated entities:
- Condition: "infectious dermatosis"
- Condition: "suppurative dermatosis"
- Condition: "allergic dermatosis"